Pancreatitis

The above is a clinical trial exclusion criterion. Annotated with entity spans:
[Condition: Pancreatitis]